¿Cuál de los siguientes fármacos puede aliviar los aumentos compensadores de la frecuencia cardíaca y de la liberación de renina que se producen en la insuficiencia cardíaca?:
1. Milrinona.
2. Digoxina.
3. Dobutamina.
4. Enalapril.
5. Metoprolol.

Respuesta correcta: 5. Metoprolol.